History of severe allergy to Iodine contrast agents

The above is a clinical trial exclusion criterion. Annotated with entity spans:
History of severe [Condition: allergy] to [Procedure: Iodine contrast agents]